lack of consent

The above is a clinical trial exclusion criterion. Annotated with entity spans:
[Informed_consent: lack of consent]